Clinical trial exclusion criterion:
pregnancy or baby nursing period or un-contracepted child bearing period woman.

Annotated entities:
- Observation: "pregnancy"
- Observation: "baby nursing period"
- Negation: "un-"
- Procedure: "contracepted"
- Observation: "child bearing period"
- Person: "woman"